下列何者屬於最典型的神經激素（neurohormone）？
A. vasopressin
B. FSH（follicle stimulating hormone）
C. thyroid hormone
D. estrogen

正確答案：A. vasopressin